Liver disease or elevated liver enzymes

The above is a clinical trial exclusion criterion. Annotated with entity spans:
[Condition: Liver disease] or [Condition: elevated liver enzymes]